En las personas mayores el agua corporal total:
1. Es la mitad que en el adulto.
2. Disminuye fundamentalmente a expensas del compartimiento intravascular.
3. Disminuye principalmente por la reducción del líquido extracelular.
4. Disminuye en gran medida como consecuencia de la pérdida de masa muscular.
5. Representa el 30% de peso corporal.

Respuesta correcta: 4. Disminuye en gran medida como consecuencia de la pérdida de masa muscular.